Clinical trial inclusion criteria:
Adults 18-65 years, who are diagnosed with functional neurologic symptom or conversion disorder. If diagnosis of seizure type then video EEG with diagnosis confirmed by board-certified neurologist with subspecialty training in epilepsy and clinical neurophysiology using the criteria of the International Classification of the Epilepsies is required. If diagnosis of motor type, documented and clinically established levels of diagnostic certainty (Williams,1995) confirmed by 2 neurologists is required.
Participants must have at least one symptom per month in the month prior to enrollment
Fluency in English spoken language

Annotated entities:
- Value: "18-65 years"
- Person: "Adults"
- Person: "18-65 years"
- Condition: "functional neurologic symptom"
- Condition: "conversion disorder"
- Condition: "seizure type"
- Procedure: "video EEG"
- Measurement: "criteria of the International Classification of the Epilepsies"
- Condition: "motor type"
- Non-query-able: "documented and clinically established levels of diagnostic certainty (Williams,1995) confirmed by 2 neurologists is required."
- Condition: "symptom"
- Multiplier: "at least one per month"
- Temporal: "in the month prior to enrollment"
- Reference_point: "to enrollment"
- Non-query-able: "Fluency in English spoken language"